Age 22 or above

The above is a clinical trial inclusion criterion. Annotated with entity spans:
[Person: Age] [Value: 22 or above]